Clinical trial exclusion criterion:
Has planned release from the Canadian Armed Forces within one year;

Entity relations:
- Has_temporal("release from the Canadian Armed Forces", "within one year")